Muchas de las propiedades de la cromatografía líquida (HPLC) y la electroforesis capilar (CE) tienen que ver con su perfil de flujo. De esta manera, el perfil de flujo es:
1. Laminar en HPLC y turbulento en CE.
2. Recto en CE y turbulento en HPLC.
3. Hiperbólico en CE y parabólico en HPLC.
4. Laminar en CE y electroosmótico en HPLC.
5. Parabólico en HPLC y plano en CE.

Respuesta correcta: 5. Parabólico en HPLC y plano en CE.